下列何者受傷，最不可能影響肌肉收縮？
A. 腓深神經（deep peroneal nerve）
B. 腓淺神經（superficial peroneal nerve）
C. 閉孔神經（obturator nerve）
D. 隱神經（saphenous nerve）

正確答案：D. 隱神經（saphenous nerve）